一位 13 歲兒童發生嚴重水腫，每日尿蛋白平均排泄量為 5.6 公克，血清白蛋白偏低，血中膽固醇升高，其腎臟切片在光學顯微鏡看來最常見的變化為何？
A. 腎小球間質細胞增生
B. 幾乎和正常腎小球一樣
C. 腎小球間質有大量免疫複合體沈著
D. 腎小球基底膜增厚

正確答案：B. 幾乎和正常腎小球一樣